造成肝疾病的病毒有很多種，下列那一種敘述符合這四種病毒 HAV、HCV、HDV 及 HEV 的共同特徵？
A. 含單股（single-stranded）RNA 基因體
B. 是糞-口（fecal-oral route）傳播路徑
C. 造成猛爆性肝炎
D. 在慢性感染時易造成宿主基因序列變異

正確答案：A. 含單股（single-stranded）RNA 基因體